Clinical trial exclusion criterion:
7. BUN or creatine above the normal limits.

Entity relations:
- Has_value("BUN", "above the normal limits")
- OR("BUN", "creatine")